Unwilling to be randomized per this protocol

The above is a clinical trial exclusion criterion. Annotated with entity spans:
[Post-eligibility: Unwilling to be randomized per this protocol]